Los diseños de investigación experimentales intrasujeto:
1. Utilizan variables independientes no manipuladas directamente por el investigador sino a través de la selección de los participantes.
2. Se basan en la comprobación de grupos independientes asignados a las condiciones experimentales.
3. Combinan dos variables independientes basadas en las características de los participantes.
4. Tienen menor validez interna que los diseños intersujetos al no utilizar la asignación aleatoria.
5. Utilizan técnicas de control específicas para controlar los efectos asociados al orden de la aplicación de las condiciones experimentales.

Respuesta correcta: 5. Utilizan técnicas de control específicas para controlar los efectos asociados al orden de la aplicación de las condiciones experimentales.